Herpes viruses have what type of genome?

Herpesviridae are a family of viruses which have a large genome of linear, double-stranded DNA.